葡萄糖生成性（glucogenic）胺基酸可在酵素作用下直接轉變為克氏循環（TCA cycle）的中間產物，下列何者錯誤？
A. 麩胺酸（glutamate）→α-酮基戊二酸（α-ketoglutarate）
B. 組胺酸（histidine）→ 琥珀醯基輔酶A（succinyl-CoA）
C. 天冬胺酸（aspartate）→草醯乙酸（oxaloacetate）
D. 酪胺酸（tyrosine）→反丁烯二酸（fumarate）

正確答案：B. 組胺酸（histidine）→ 琥珀醯基輔酶A（succinyl-CoA）